Clinical trial inclusion criterion:
Outpatient with primary DSM- IV OCD

Entity relations:
- Has_qualifier("OCD", "DSM- IV")
- Has_qualifier("OCD", "primary")
- AND("OCD", "Outpatient")